Los materiales cerámicos son:
1. Duros y frágiles.
2. Tenaces y dúctiles.
3. Blandos y maleables.
4. Dúctiles y maleables.
5. Blandos y frágiles.

Respuesta correcta: 1. Duros y frágiles.